Prisoner Status

The above is a clinical trial exclusion criterion. Annotated with entity spans:
[Person: Prisoner] Status